肥大細胞（mast cells）的異染性（metachromasia）主要是分泌顆粒中所含的那一成分所造成？
A. 肝素（heparin）
B. 溶菌酶（lysozyme）
C. 酵素原（zymogen）
D. 黏蛋白原（mucinogen）

正確答案：A. 肝素（heparin）